置放中心靜脈導管（central venous catheter），下列那一位置最常為麻醉醫師於手術麻醉時使用？
A. subclavian vein
B. antecubital vein
C. femoral vein
D. right internal jugular vein

正確答案：D. right internal jugular vein